Severe kidney failure (eGFR<15 ml/min)

The above is a clinical trial exclusion criterion. Annotated with entity spans:
[Qualifier: Severe] [Condition: kidney failure] ([Measurement: eGFR][Value: <15 ml/min])